Clinical trial exclusion criterion:
irritable bowel, unexplained intermittent vomiting, severe abdominal pain, chronic diarrhea or constipation

Annotated entities:
- Condition: "irritable bowel"
- Condition: "vomiting"
- Condition: "abdominal pain"
- Qualifier: "intermittent"
- Condition: "diarrhea"
- Condition: "constipation"
- Qualifier: "chronic"
- Qualifier: "severe"